What is the triple screening test performed during pregnancy measuring?

Alpha-fetoprotein (AFP), human chorionic gonadotropin (hCG) and unconjugated estriol (uE3)